Clinical trial exclusion criterion:
diabetic

Annotated entities:
- Condition: "diabetic"